La rigidez afectiva se caracteriza por:
1. Cambios rápidos en el estado de ánimo.
2. La expresión afectiva es discordante con la situación.
3. Ausencia de sentimientos positivos reactivos.
4. Incapacidad para modular el afecto en función de las situaciones.
5. Respuestas emocionales poco intensas.

Respuesta correcta: 4. Incapacidad para modular el afecto en función de las situaciones.